由交感神經末梢分泌之 Norepinephrine，主要由何種機制將它從突觸間隙清除？
A. 由神經末梢再回收（re-uptake）
B. 被突觸後細胞所含之酵素分解
C. 進入血液循環後由肝臟清除
D. 被突觸後細胞再回收

正確答案：A. 由神經末梢再回收（re-uptake）